What is the relationship between thyroid hormone and inflammatory markers in heart failure patients?

There is an inverse correlation between inflammatory markers (IL-6 and TNF alfa and PCR) and FT3 levels in patients with heart failure